25歲頭部外傷男性病患，至急診時昏迷指數（Glasgow Coma Scale, GCS）7分，經放置氣管內管之後，確認氣管內管是否置於氣管內的方式，可依2010年American Heart  Assoication （AHA）出版之 Emergency Cardiovascular Care 的建議，除了：
A. 五點聽診
B. 照胸部X光
C. 潮氣末二氧化碳分壓（End-Tidal CO2 ，ETCO2）做二氧化碳濃度監測
D. 直接目測氣管內管通過聲帶

正確答案：B. 照胸部X光